Clinical trial inclusion criterion:
predicted ICU stay more than 7 days

Entity relations:
- Has_value("predicted ICU stay", "more than 7 days")
- multi("predicted ICU stay", "ICU")